Are between 18 and 70 years of age

The above is a clinical trial inclusion criterion. Annotated with entity spans:
Are [Value: between 18 and 70 years] of [Person: age]